Clinical trial exclusion criterion:
2. Recent (< 3 months) acute macrovascular event e.g. acute coronary syndrome or cardiac surgery.

Annotated entities:
- Parsing_Error: "2."
- Temporal: "< 3 months"
- Temporal: "Recent"
- Condition: "acute macrovascular event"
- Condition: "acute coronary syndrome"
- Condition: "cardiac surgery"